Severe malnutrition (weight-for-height Z-score <-3)

The above is a clinical trial exclusion criterion. Annotated with entity spans:
[Qualifier: Severe] [Condition: malnutrition] ([Measurement: weight-for-height Z-score] [Value: <-3])